Heart rate 55-100 beats per minute

The above is a clinical trial inclusion criterion. Annotated with entity spans:
[Measurement: Heart rate] [Value: 55-100 beats per minute]